一位 50 歲的男性，搬一個重約 10 公斤的物品時，突然引起嚴重的背痛，且會令他痛到無法入睡。脊椎 X 光檢查顯示在第十胸椎椎體高度減少，左側椎莖（pedicle）影像模糊，但椎體終板（endplate）及椎間盤完整。依照病史及 X 光檢查結果來判斷，下列何者是最適當的診斷？
A. 細菌感染
B. 退化性病變
C. 惡性腫瘤轉移
D. 骨質疏鬆壓迫性骨折

正確答案：C. 惡性腫瘤轉移